Un anciano se dirige a la enfermera refiriendo: “me siento desbordado con el tratamiento que me han puesto; no sé si voy a ser capaz de seguirlo”. De las siguientes respuestas de la enfermera ¿Cuál constituye el mejor ejemplo de comunicación terapéutica?:
1. “Tiene razón. El tratamiento es muy pesado, pero créame, el tratamiento es bueno”.
2. “No se preocupe ni le de tanta importancia. Ya vera como todo irá bien”.
3. “Cuénteme, ¿Por qué cree que no va a poder seguirlo? ¿cree qué no le va a ayudar?”
4. “Debe confiar en el médico que le ha puesto el tratamiento. Él sabe lo que hace”.

Respuesta correcta: 3. “Cuénteme, ¿Por qué cree que no va a poder seguirlo? ¿cree qué no le va a ayudar?”